La catalasa:
1. Actúa sobre el peróxido de hidrógeno.
2. Da lugar a la formación de peróxido de hidrógeno.
3. Actúa sobre el anión superóxido.
4. Convierte el peróxido de hidrógeno en anión superóxido.
5. Utiliza el glutatión como cofactor.

Respuesta correcta: 1. Actúa sobre el peróxido de hidrógeno.